Clinical trial inclusion criterion:
outpatients aged 18-70 years

Entity relations:
- Has_value("aged", "18-70 years")